Subject has an active systemic infection.

The above is a clinical trial exclusion criterion. Annotated with entity spans:
Subject has an [Qualifier: active] [Condition: systemic infection].